Clinical trial inclusion criterion:
Hepatitis B virus DNA not detectable(Roche Cobas).

Entity relations:
- Has_value("Hepatitis B virus DNA", "not detectable")